下列何者衍生自脊索（notochord）？
A. 椎體（body of vertebra）
B. 髓核（nucleus pulposus）
C. 纖維環（anulus fibrosus）
D. 椎弓（vertebral arch）

正確答案：B. 髓核（nucleus pulposus）